Patients that have had a high tibial osteotomy or femoral osteotomy

The above is a clinical trial exclusion criterion. Annotated with entity spans:
Patients that have had a [Procedure: high tibial osteotomy] or [Procedure: femoral osteotomy]